Clinical trial inclusion criterion:
Must have at least 6 mm of residual bone

Annotated entities:
- Value: "at least 6 mm"
- Measurement: "residual bone"